當施行腹腔鏡手術時，如果長時間腹內壓大於 20 mmHg，會有下列何種併發症？①二氧化碳栓塞 （CO2 embolus） ②血中二氧化碳濃度過高 ③靜脈回流血減少而導致低血壓
A. 僅①③
B. 僅①②
C. 僅③
D. ①②③

正確答案：D. ①②③